Clinical trial inclusion criterion:
Body mass index > 35

Annotated entities:
- Measurement: "Body mass index"
- Value: "> 35"